下列何種病毒，通常不經過垂直感染傳給胎兒？
A. 德國麻疹病毒（Rubella virus）
B. 巨細胞病毒（Cytomegalovirus）
C. 呼腸病毒（Reovirus）
D. 單純疱疹病毒（Herpes simplex virus）

正確答案：C. 呼腸病毒（Reovirus）